我國全民健康保險之成人預防保健服務於 1996 年 3 月起實施，其服務內容不包括下列何者？
A. 身體理學檢查
B. 健康諮詢
C. 血液生化檢查
D. 疫苗接種

正確答案：D. 疫苗接種